Clinical trial exclusion criterion:
Suicidal ideation with intent to act or with specific plan and intent in the past 6 months (Type 4 - 5 ideation on the Columbia Suicide Severity Rating Scale) or a concerning history of prior suicidal behavior.

Entity relations:
- Has_temporal("Suicidal ideation", "past 6 months")
- Has_value("Columbia Suicide Severity Rating Scale", "Type 4 ideation")
- OR("Type 4 ideation", "Type 5 ideation")